Clinical trial exclusion criterion:
COPD exacerbation, very severe COPD with hypoxemia at low altitude (FEV1/FVC <0.7, FEV1 <40% predicted, oxygen saturation on room air <92% at 750 m).

Entity relations:
- Has_qualifier("COPD", "very severe")
- Has_qualifier("hypoxemia", "low altitude")
- Has_qualifier("oxygen saturation", "room air")
- Has_value("oxygen saturation", "<92% at 750 m")
- Has_value("FEV1", "<40% predicted")
- Has_value("FEV1/FVC", "<0.7")
- AND("hypoxemia", "FEV1/FVC")
- AND("COPD", "hypoxemia")
- AND("COPD exacerbation", "COPD")
- OR("FEV1/FVC", "FEV1", "oxygen saturation")